下列何種膽鹼脂酶抑制劑（Cholinesterase inhibitors），不是屬於四級氨（Quaternary ammonium group），且具有高脂溶性，可以通過腦血屏障礙（Blood-brain-barrier）？
A. 毒扁豆素（Physostigmine）
B. Edrophonium
C. 乙醯膽鹼促進劑（Pyridostigmine）
D. 新斯弟格明（Neostigmine）

正確答案：A. 毒扁豆素（Physostigmine）